Clinical trial inclusion criterion:
Fasting plasma glucose < 7,0 mM, HbA1c < 48 mmol/mol 3 months after RYGB

Entity relations:
- multi("RYGB", "RYGB")
- Has_index("3 months after RYGB", "RYGB")
- Has_value("HbA1c", "< 48 mmol/mol")
- Has_value("Fasting plasma glucose", "< 7,0 mM")
- Has_temporal("HbA1c", "3 months after RYGB")
- OR("Fasting plasma glucose", "HbA1c")